How do circRNAs relate to tumorigenesis?

Circular RNA may promote or repress tumorigenesis.